一位65歲男性糖尿病患，最近剛在門診治療肺結核，追蹤抽血結果卻發現異常：total bilirubin 3 mg/dL（正常值：0.2～1.2）、direct bilirubin 0.3 mg/dL（正常值：0～0.4）。下列敘述何者最不適當？
A. 可能與肺結核藥物引發溶血有關
B. 病患此時	尿將發現urine bilirubin呈陽性反應
C. 病患此時	尿將發現urine urobilinogen呈陽性反應
D. 病患此時	血中的糖化血色素（HbA1C），會有假性偏低的可能

正確答案：B. 病患此時	尿將發現urine bilirubin呈陽性反應